What is the mechanism of the auxin-inducible degron system?

Plants have evolved a unique system in which the plant hormone auxin directly induces rapid degradation of the AUX/IAA family of transcription repressors by a specific form of the SCF E3 ubiquitin ligase. Other eukaryotes lack the auxin response but share the SCF degradation pathway, allowing the transplantation of the auxin-inducible degron (AID) system into nonplant cells and the use of a small molecule to conditionally control protein stability.